Clinical trial exclusion criteria:
Multiple pregnancy
Prior spontaneous preterm birth or second trimester losses between 16(0) and 36(6) weeks
Cerclage in situ
Painful regular uterine contraction and/or preterm labor
Ruptured membranes
Major fetal defects
Active vaginal bleeding
Placenda previa and/or accreta
Cervical dilation >1.5 cm and/or visible membranes by pelvic exam
Suspicion of chorioamnionitis

Annotated entities:
- Condition: "Multiple pregnancy"
- Temporal: "Prior"
- Condition: "spontaneous preterm birth"
- Condition: "losses"
- Qualifier: "between 16(0) and 36(6) weeks"
- Qualifier: "second trimester"
- Condition: "Cerclage in situ"
- Condition: "Painful regular uterine contraction"
- Condition: "preterm labor"
- Condition: "Ruptured membranes"
- Condition: "Major fetal defects"
- Condition: "Active vaginal bleeding"
- Condition: "Placenda previa"
- Condition: "accreta"
- Measurement: "Cervical dilation"
- Value: ">1.5 cm"
- Condition: "visible membranes"
- Procedure: "pelvic exam"
- Mood: "Suspicion of"
- Condition: "chorioamnionitis"